Patient has demonstrated compliance, as assessed by the investigator, with the parent study requirements

The above is a clinical trial inclusion criterion. Annotated with entity spans:
[Non-query-able: Patient has demonstrated compliance, as assessed by the investigator, with the parent study requirements]